Women with history of breast cancer or breast surgery in the same quadrant

The above is a clinical trial exclusion criterion. Annotated with entity spans:
[Person: Women] with history of [Condition: breast cancer] or [Condition: breast surgery] in the [Qualifier: same quadrant]